Clinical trial exclusion criterion:
Receipt of DTaP, IPV, PCV13, or Hib prior to enrollment. Previous administration of the first dose of HBV is permitted

Entity relations:
- Has_temporal("DTaP", "prior to enrollment")
- Has_index("prior to enrollment", "enrollment")
- OR("DTaP", "Hib", "IPV", "PCV13")